Clinical trial exclusion criterion:
Patients with active infections requiring antibiotics within one month of registration

Entity relations:
- Has_temporal("infections", "active")
- AND("infections", "antibiotics")
- Has_temporal("infections", "within one month of registration")